Clinical trial exclusion criterion:
Platelet count < 100,000/ml

Entity relations:
- Has_value("Platelet count", "< 100,000/ml")